局部麻醉藥物lidocaine 主要經由阻斷何種離子進入細胞以抑制神經傳導？
A. 鈉
B. 鈣
C. 鉀
D. 氯

正確答案：A. 鈉